¿Cómo se denomina el máximo volumen de aire que un sujeto puede espirar después de una inspiración máxima?:
1. Capacidad pulmonar total.
2. Volumen de reserva espiratoria.
3. Capacidad inspiratoria.
4. Capacidad vital.
5. Volumen residual.

Respuesta correcta: 4. Capacidad vital.